Clinical trial inclusion criterion:
Fulfillment of the Diagnostic and Statistical Manual of Mental Disorders, Fourth Edition, (DSM-IV) diagnostic criteria for ADHD

Annotated entities:
- Qualifier: "Diagnostic and Statistical Manual of Mental Disorders, Fourth Edition, (DSM-IV) diagnostic criteria"
- Condition: "ADHD"